Which receptors does bimagrumab block?

Bimagrumab blocks the activin type II receptors.